下列何者不是第 4 和第 6 鰓弓軟骨癒合的產物？
A. 會厭（epiglottis）
B. 甲狀軟骨（thyroid cartilage）
C. 杓狀軟骨（arytenoid cartilage）
D. 環狀軟骨（cricoid cartilage）

正確答案：A. 會厭（epiglottis）